Active uncontrolled infection

The above is a clinical trial exclusion criterion. Annotated with entity spans:
[Temporal: Active] [Qualifier: uncontrolled] [Condition: infection]